Primary indication for ACE inhibitor use, i.e. Congestive Heart Failure, CAD, diabetes

The above is a clinical trial exclusion criterion. Annotated with entity spans:
[Condition: Primary indication for ACE inhibitor use], i.e. [Condition: Congestive Heart Failure], [Condition: CAD], [Condition: diabetes]